Which cells mature in the human thymus?

Thymus progenitor cells mature in the human thymus through differentiation into cardiomyocytes and fibroblasts.